先天性腎上腺增生症（congenital adrenal hyperplasia, CAH）的遺傳模式為：
A. 體染色體顯性遺傳
B. 體染色體隱性遺傳
C. 性聯遺傳
D. 性染色體異常

正確答案：B. 體染色體隱性遺傳